Clinical trial inclusion criterion:
Ulcerative colitis patients with moderate to severe activity who achieved a clinical remission by the first course of corticosteroids

Entity relations:
- Has_qualifier("Ulcerative colitis", "moderate to severe")
- Has_multiplier("corticosteroids", "first course")
- Has_index("by the first course of corticosteroids", "first course of corticosteroids")
- multi("first course of corticosteroids", "corticosteroids")
- Has_temporal("clinical remission", "by the first course of corticosteroids")
- AND("Ulcerative colitis", "clinical remission")